Clinical trial exclusion criterion:
rheumatic disease (RA, SpA, SLE)

Annotated entities:
- Condition: "rheumatic disease"
- Condition: "RA"
- Condition: "SpA"
- Condition: "SLE"